Clinical trial exclusion criterion:
previous adverse reaction or known allergy to local anaesthetics or opioids or paracetamol

Annotated entities:
- Condition: "adverse reaction"
- Condition: "allergy"
- Procedure: "local anaesthetics"
- Drug: "opioids"
- Drug: "paracetamol"